Clinical trial inclusion criterion:
Esophageal varices with high bleeding risk: more than F2 and red color sign

Annotated entities:
- Condition: "Esophageal varices"
- Observation: "high bleeding risk"
- Measurement: "F2"
- Multiplier: "more than"
- Condition: "red color sign"